消化道中，下列何者的胞質具有最強的嗜伊紅性（eosinophilic）？
A. 腸內分泌細胞（enteroendocrine cell）
B. 頸黏液細胞（mucous neck cell）
C. 主細胞（chief cell）
D. 壁細胞（parietal cell）

正確答案：D. 壁細胞（parietal cell）